Clinical trial exclusion criterion:
Perinephritic abscess

Annotated entities:
- Condition: "Perinephritic abscess"